Clinical trial exclusion criterion:
Cardiac MRI T2* <10ms;

Annotated entities:
- Measurement: "Cardiac MRI T2*"
- Value: "<10ms"